En el funcionamiento de la atención en sujetos ansiosos, si lo comparamos con las personas no ansiosas, ¿qué se puede decir?
1. Que existen diferencias en cuanto al contenido de la información a la que dirige la atención.
2. Que es un procesamiento en “espiral”.
3. Que no se cometen sesgos preatencionales.
4. Que mantienen una atención autofocalizada.
5. Que no presentan mayor selectividad atencional.

Respuesta correcta: 1. Que existen diferencias en cuanto al contenido de la información a la que dirige la atención.